Women under the age of 18,

The above is a clinical trial exclusion criterion. Annotated with entity spans:
[Person: Women] under the [Person: age] of [Value: 18],